對於鼻咽血管纖維瘤（Nasopharyngeal angiofibroma）的治療，下列何者正確？
A. 以放射治療為主
B. 以化學治療為主
C. 以化學加放射治療為主
D. 以手術為主

正確答案：D. 以手術為主